Clinical trial inclusion criterion:
Able to operate a patient-controlled analgesia device (PCA)

Annotated entities:
- Device: "patient-controlled analgesia device"
- Device: "PCA"